有關廣東住血線蟲（Angiostrongylus cantonensis）感染人體的敘述，何者錯誤？
A. 成蟲寄生在肺動脈間
B. 可以藉由腦脊髓液進行檢查
C. 幼蟲會在腦實質組織中發育
D. 會藉由生食蝸牛肉而受到感染

正確答案：A. 成蟲寄生在肺動脈間